Clinical trial inclusion criterion:
The patient was receiving anti-vitamin K (AVK) treatment before percutaneous implantation of the aortic valve

Annotated entities:
- Drug: "anti-vitamin K"
- Drug: "AVK"
- Temporal: "before percutaneous implantation of the aortic valve"
- Reference_point: "percutaneous implantation of the aortic valve"